The patients underwent neoadjuvant chemotherapy plus surgery or directly modified radical mastectomy or breast-conserving surgery (plus sentinel lymph node biopsy or axillary lymph node dissection) after diagnosis of breast cancer.

The above is a clinical trial inclusion criterion. Annotated with entity spans:
The patients underwent [Procedure: neoadjuvant chemotherapy] plus [Procedure: surgery] or [Qualifier: directly modified] [Procedure: radical mastectomy] or [Procedure: breast-conserving surgery] (plus [Procedure: sentinel lymph node biopsy] or [Procedure: axillary lymph node dissection]) [Temporal: after diagnosis of breast cancer].